一位 70 歲男病人，主訴吞嚥困難，牙關緊鎖（trismus），理學檢查，頸部僵硬，住院後，出現挺直性痙攣（orthotonos），角弓反張（opisthotonos），全身性搐搦（generalized convulsions），最適當的初步檢查為何？
A. 測酒精濃度
B. 尿液測毒品反應
C. 檢查身體或四肢有沒有傷口
D. 測 VDRL

正確答案：C. 檢查身體或四肢有沒有傷口